Patient's written informed consent. Adequate cognitive capacity.

The above is a clinical trial inclusion criterion. Annotated with entity spans:
[Post-eligibility: Patient's written informed consent. Adequate cognitive capacity].